Which company produces patisiran?

Patisiran has been developed by Alnylam Pharmaceuticals.